Patients with histologically confirmed advanced (stage IV) gastric cancer, NSCLC, breast cancer or ovarian cancer, who choose monotherapy of oral vascular targeting drug (apatinib) due to intolerability or inappropriateness of other therapies;

The above is a clinical trial inclusion criterion. Annotated with entity spans:
Patients with [Qualifier: histologically confirmed] [Qualifier: advanced] ([Qualifier: stage IV]) [Condition: gastric cancer], [Condition: NSCLC], [Condition: breast cancer] or [Condition: ovarian cancer], who choose [Procedure: monotherapy] of [Drug: oral vascular targeting drug] ([Drug: apatinib]) [Non-representable: due to intolerability or inappropriateness of other therapies];